Chronic liver disease with aminotransferase levels two times or more above the local upper limit of normal range

The above is a clinical trial exclusion criterion. Annotated with entity spans:
[Condition: Chronic liver disease] with [Measurement: aminotransferase] levels [Value: two times or more above the local upper limit of normal range]